10. Subject needs mechanical ventilation;

The above is a clinical trial exclusion criterion. Annotated with entity spans:
10. Subject needs [Procedure: mechanical ventilation];